Clinical trial inclusion criterion:
With the presence of a non-carious cervical lesion (LCNCs) that needs to be restored. This lesion should be non-carious, non-retentive, with at least 1 mm and up to 3 mm depth, should involve both enamel and dentin of vital teeth without mobility, and present hypersensitivity;

Annotated entities:
- Condition: "non-carious cervical lesion (LCNCs)"
- Procedure: "restored"
- Mood: "needs to be"
- Condition: "lesion"
- Qualifier: "non-carious"
- Qualifier: "non-retentive"
- Value: "at least 1 mm and up to 3 mm"
- Measurement: "depth"
- Qualifier: "involve both enamel and dentin"
- Condition: "hypersensitivity"